Los nucleosomas están:
1. Solo en la hetrocromatina.
2. Solo en la eucromatina.
3. Solo en los cromosomas.
4. En la eucromatina, en la heterocromatina y en los cromosomas.
5. En todo tipo de cromatina, pero no en los cromosomas.

Respuesta correcta: 4. En la eucromatina, en la heterocromatina y en los cromosomas.